1. Have dementia or delirium (as determined by the palliative care specialist) at study entry.

The above is a clinical trial exclusion criterion. Annotated with entity spans:
1. Have [Condition: dementia] or [Condition: delirium] (as determined by the palliative care specialist) [Temporal: at study entry].